Not planned for discharge within 60 hours of study entry

The above is a clinical trial inclusion criterion. Annotated with entity spans:
[Measurement: Not] [Mood: planned] for [Procedure: discharge] [Temporal: within 60 hours of study entry]